Clinical trial exclusion criterion:
Cirrhosis, chronic active hepatitis or chronic persistent hepatitis

Entity relations:
- OR("Cirrhosis", "chronic active hepatitis", "chronic persistent hepatitis")